Individuals with non-MRI compatible aneurysm clips

The above is a clinical trial exclusion criterion. Annotated with entity spans:
Individuals with [Negation: non]-[Qualifier: MRI compatible] [Device: aneurysm clips]